Kidney transplant recipients

The above is a clinical trial inclusion criterion. Annotated with entity spans:
[Procedure: Kidney transplant] recipients